Clinical trial inclusion criterion:
No previous blood transfusion

Entity relations:
- Has_temporal("blood transfusion", "previous")
- Has_negation("blood transfusion", "No")